Clinical trial exclusion criterion:
Previous exposure to cytotoxic drugs or pelvic irradiation.

Annotated entities:
- Condition: "exposure"
- Drug: "cytotoxic drugs"
- Procedure: "pelvic irradiation"